Clinical trial inclusion criterion:
Subjects with over moderate atopic dermatitis (SCORAD score > 20)

Entity relations:
- Has_value("SCORAD score", "> 20")
- AND("atopic dermatitis", "SCORAD score")
- Has_qualifier("atopic dermatitis", "over moderate")